10. Acute decompensated heart failure.

The above is a clinical trial exclusion criterion. Annotated with entity spans:
[Parsing_Error: 10.] [Condition: Acute decompensated heart failure].